28歲年輕男性騎乘機車不慎摔車，右大腿腫痛變形，送至急診後，X光檢查顯示右股骨中段螺旋性骨折（femoral midshaft spiral fracture）。病患無合併其他外傷，周邊循環良好，同時沒有發生神經傷害。此時應採下列何種固定方式，可獲得最佳的治療效果？
A. 骨骼牽引固定（skeletal traction）
B. 石膏固定（casting）
C. 鎖定式骨髓內釘固定（intramedullary interlocking nail）
D. 骨外固定（external fixation）

正確答案：C. 鎖定式骨髓內釘固定（intramedullary interlocking nail）